Clinical trial inclusion criterion:
Age >18 years

Entity relations:
- Has_value("Age", ">18 years")